Completely edentulous

The above is a clinical trial exclusion criterion. Annotated with entity spans:
[Qualifier: Completely] [Condition: edentulous]